Are human enhancers or promoters evolving faster?

Rapid evolution of enhancers is a universal feature of mammalian genomes.